下列物質的主要吸收位置，何者不是在十二指腸和近端空腸？
A. 鈣（Calcium）
B. 鐵（Iron）
C. 葉酸（Folic acid）
D. 膽汁酸（Bile acid）

正確答案：D. 膽汁酸（Bile acid）